Must speak English or Spanish

The above is a clinical trial inclusion criterion. Annotated with entity spans:
[Non-query-able: Must speak English or Spanish]